Clinical trial exclusion criteria:
Patients who were pregnant, nursing or not able to give written informed consent were excluded.

Annotated entities:
- Condition: "pregnant"
- Condition: "nursing"
- Observation: "able to give written informed consent"
- Negation: "not"